Clinical trial exclusion criterion:
Contra-indication for multiorgan procurement (infections, cancer, etc)

Annotated entities:
- Condition: "Contra-indication"
- Procedure: "multiorgan procurement"
- Condition: "infections"
- Condition: "cancer"